Male or female patients;

The above is a clinical trial inclusion criterion. Annotated with entity spans:
[Person: Male] or [Person: female] patients;